Clinical trial exclusion criterion:
Patients with chronic obstructive pulmonary disease who are on systemic corticosteroids.

Annotated entities:
- Condition: "chronic obstructive pulmonary disease"
- Drug: "systemic corticosteroids"